一位中年糖尿病患者，突然發現右眼瞼下垂，複視，瞳孔變大，對光反射喪失，下列何項處置最合理？
A. 馬上住院安排做腦部血管檢查
B. 照會眼科並安排一系列眼睛檢查
C. 抽血檢驗血糖，並控制血糖
D. 測量血壓，並維持正常血壓

正確答案：A. 馬上住院安排做腦部血管檢查